Clinical trial inclusion criterion:
Systolic blood pressure 90-140 mmHg

Annotated entities:
- Measurement: "Systolic blood pressure"
- Value: "90-140 mmHg"